13. Use of concomitant drugs that prolong QT/QTc interval and/or are CYP3A4 inhibitors are prohibited with the exception of antibiotics, antifungals, and other antimicrobials that are used as standard of care to prevent or treat infections and other such drugs that are considered absolutely essential for the care of the patient.

The above is a clinical trial exclusion criterion. Annotated with entity spans:
13. Use of concomitant [Drug: drugs that prolong QT/QTc interval] and/or are [Drug: CYP3A4 inhibitors] are prohibited [Negation: with the exception of] [Drug: antibiotics], [Drug: antifungals], and other [Drug: antimicrobials] that are used as standard of care to prevent or treat infections and other such drugs that are considered absolutely essential for the care of the patient.